當病患被診斷出有癌症時，基於家屬要求，醫護人員不告知病患確實診斷，是違反了生命倫理學的那項原則？
A. 尊重自主原則（respect for autonomy）
B. 行善原則（beneficence）
C. 正義原則（justice）
D. 不傷害原則（nonmaleficence）

正確答案：A. 尊重自主原則（respect for autonomy）